針對某類型的淋巴瘤做染色體變異的分析研究，發現該類型淋巴瘤常見有 3 種染色體的轉位變異： t（8；14）、t（2；8）、t（8；22），請問該類淋巴瘤最可能為下列何者？
A. Mantle cell lymphoma
B. Follicular lymphoma
C. Burkitt's lymphoma
D. Diffuse large B cell lymphoma

正確答案：C. Burkitt's lymphoma